有關狂犬病病毒（Rabies viruses）的敘述，下列何者錯誤？
A. 產生 Negri 小體（Negri body）
B. 不能被乙醚破壞
C. 是 RNA 病毒
D. 主要侵犯神經組織

正確答案：B. 不能被乙醚破壞